Uncontrolled psychiatric disorder

The above is a clinical trial exclusion criterion. Annotated with entity spans:
[Qualifier: Uncontrolled] psychiatric disorder